臨床上，使用下列何種儀器檢查患者，較無法得知受檢者的眼球屈光狀態？
A. 自動屈折計（automated refractometer）
B. 網膜檢影鏡（retinoscope or skiascope）
C. 直接眼底鏡（direct ophthalmoscope）
D. 眼球突出計（exophthalmometer）

正確答案：D. 眼球突出計（exophthalmometer）